Clinical trial exclusion criterion:
Patients not willing to fill consent/ assent form are also excluded from study.

Annotated entities:
- Post-eligibility: "Patients not willing to fill consent/ assent form are also excluded from study."
- Non-query-able: "Patients not willing to fill consent/ assent form are also excluded from study."